Sobre la biología molecular del cáncer:
1. Los oncogenes son derivados mutados de genes normales, llamados protooncogenes, cuya función es promover la proliferación o supervivencia celular.
2. Los oncogenes son genes que sintetizan proteínas que inhiben la proliferación celular.
3. Los genes supresores de tumores sintetizan proteínas que inhiben la muerte celular.
4. Los protooncogenes sintetizan proteínas que promueven la muerte celular.
5. La apoptosis es una forma de activación de los protooncogenes.

Respuesta correcta: 1. Los oncogenes son derivados mutados de genes normales, llamados protooncogenes, cuya función es promover la proliferación o supervivencia celular.